Se ha comprobado que las anfetaminas tienen efectos reforzantes debido a que:
1. Son agonistas gabaérgicos.
2. Son antagonistas dopaminérgicos.
3. Son antagonistas serotoninérgicos.
4. Son agonistas dopaminérgicos.
5. Son agonistas serotoninérgicos.

Respuesta correcta: 4. Son agonistas dopaminérgicos.